What is a cytokine storm?

Cytokine storm is a poorly understood clinical entity caused by an undesired and ag grandized immune system response leading to unregulated activation of the proinflammatory cascade, often contributing to multisystem organ failure and even death.